Una paciente de 65 años debutó dos años antes con una apraxia del habla y evolutivamente ha desarrollado un parkinsonismo rígido-acinético de predominio en hemicuerpo derecho con mioclonías sobreimpuestas y fenómeno de mano alienígena o miembro extraño. ¿Qué diagnóstico considera más probable?
1. Enfermedad de Parkinson.
2. Degeneración corticobasal.
3. Enfermedad de Alzheimer.
4. Enfermedad de Huntington.

Respuesta correcta: 2. Degeneración corticobasal.